Clinical trial exclusion criterion:
Short bowel syndrome that can cause inflammatory bowel disease (ulcerative colitis, Crohn's disease) and drug absorption disorder.

Entity relations:
- Has_mood("inflammatory bowel disease", "can cause")
- multi("that can cause inflammatory bowel disease", "inflammatory bowel disease")
- Has_qualifier("Short bowel syndrome", "that can cause inflammatory bowel disease")
- Subsumes("Short bowel syndrome", "ulcerative colitis")
- OR("ulcerative colitis", "Crohn's disease")